Las constricciones secundarias cromosómicas contienen:
1. ADN de secuencia única.
2. Genes ribosómicos.
3. Genes micro-ARNs.
4. ADN centromérico.
5. Genes de histomnas.

Respuesta correcta: 2. Genes ribosómicos.